Clinical trial exclusion criterion:
Patient not requiring IV morphine (pain score 5/10 or less)

Annotated entities:
- Negation: "not"
- Mood: "requiring"
- Drug: "IV morphine"
- Measurement: "pain score"
- Value: "5/10 or less"